Clinical trial exclusion criterion:
Limb disabled;

Annotated entities:
- Condition: "Limb disabled"